Clinical trial exclusion criterion:
Poor oral hygiene on a non-compliant individual

Annotated entities:
- Condition: "Poor oral hygiene"
- Observation: "non-compliant"
- Non-query-able: "non-compliant"